第一年住院醫師，做闌尾切除手術時，找不到闌尾在何處，你若是他的主治醫師，請你告訴他下列何種方法最容易找到闌尾？
A. 沿著迴盲瓣（ileocecal valve）往盲腸（cecum）平行方向去找
B. 沿著升結腸（ascending colon）的結腸袋（haustra）往身體下方去找
C. 沿著升結腸（ascending colon）的結腸帶（teniae coli）往身體下方去找
D. 先找到迴腸終端（terminal ileum）再往身體右側去找

正確答案：C. 沿著升結腸（ascending colon）的結腸帶（teniae coli）往身體下方去找